Clinical trial exclusion criterion:
The existence of scar or fibrosis area constituting =50% of total lesion area

Entity relations:
- Has_value("scar area", "=50% of total lesion area")
- OR("scar area", "fibrosis area")